Clinical trial inclusion criterion:
3. Traumatic and non-traumatic, non-progressive lesions

Annotated entities:
- Parsing_Error: "3."
- Qualifier: "non-traumatic"
- Condition: "lesions"
- Qualifier: "Traumatic"
- Qualifier: "non-progressive"